El paso lento de la reacción SN1 involucra la formación de:
1. Un ión.
2. Dos iones.
3. Tres iones.
4. Especies sin carga.

Respuesta correcta: 2. Dos iones.